Clinical trial inclusion criterion:
informed consent

Annotated entities:
- Non-query-able: "informed consent"
- Post-eligibility: "informed consent"